How is Burke-Fahn-Marsden Dystonia scale used?

Burke-Fahn-Marsden Dystonia Rating Scale (BFMDRS) includes the movement and disability scales was used to evaluate the dystonia severity of the eyes, the mouth, speech, and swallowing.